下列何種革蘭氏陽性細菌的細胞壁醣複合物（glycoconjugates）之合成，可以被抗生素 penicillin所抑制？
A. glycolipids
B. proteoglycans
C. glycoproteins
D. peptidoglycans

正確答案：D. peptidoglycans